Clinical trial exclusion criterion:
Patients who have received the PPSV23 vaccine in the last 5 years

Entity relations:
- Has_temporal("PPSV23 vaccine", "in the last 5 years")